下列何者不屬於酒癮患者治療之復健工作？
A. 維持不飲酒的動機
B. 維持工作以改變生活形態
C. 預防復發
D. 長期服用戒酒藥物

正確答案：D. 長期服用戒酒藥物